Clinical trial exclusion criterion:
untreated vaginitis

Annotated entities:
- Condition: "untreated vaginitis"